Clinical trial exclusion criterion:
History of hypersensitivity or adverse reaction to local anesthetics, opioid, or any ingredient of the medications administered in this study.

Annotated entities:
- Condition: "hypersensitivity"
- Condition: "adverse reaction"
- Drug: "local anesthetics"
- Drug: "opioid"
- Drug: "ingredient of the medications administered in this study"